皮膚疣（skin warts）之生成可能與下列何種病毒相關？
A. 人類單純疱疹病毒（human herpes simplex virus）第 1 及 2 型
B. 人類乳頭瘤病毒（human papillomavirus）第 1 及 2 型
C. 人類乳頭瘤病毒第 16 及 18 型
D. 腺病毒（adenovirus）40 及 41 型

正確答案：B. 人類乳頭瘤病毒（human papillomavirus）第 1 及 2 型